Clinical trial inclusion criterion:
6. ECOG Performance Status of 0 or 1.

Entity relations:
- Has_value("ECOG Performance Status", "0 or 1")